History of noncompliance with medical regimens, or patients who are considered to be potentially unreliable or unable to participate

The above is a clinical trial exclusion criterion. Annotated with entity spans:
[Post-eligibility: History of noncompliance with medical regimens, or patients who are considered to be potentially unreliable or unable to participate]